Clinical trial inclusion criterion:
Patients who have undergone prostatectomy: any rise in PSA or

Entity relations:
- Has_value("PSA", "rise")
- AND("prostatectomy", "PSA")